undergoing elective posterior spine single-level instrumentation surgery

The above is a clinical trial exclusion criterion. Annotated with entity spans:
[Temporal: undergoing] [Qualifier: elective] [Qualifier: posterior spine] [Procedure: single-level instrumentation surgery]